下列那一種病毒感染可能引起軍隊中常發生之發燒、咳嗽、喉嚨痛、咽喉炎及頸腺炎（cervical adenitis）等病徵之疾病？
A. 副流行性感冒病毒（Parainfluenza virus）
B. 人類乳突狀病毒（HPV）
C. 單純疹病毒（Herpes simplex virus）
D. 腺病毒（Adenovirus）

正確答案：D. 腺病毒（Adenovirus）